Electrolyte imbalance (hypocalcaemia, hyponatremia and hypoglycemia)

The above is a clinical trial exclusion criterion. Annotated with entity spans:
[Condition: Electrolyte imbalance] ([Condition: hypocalcaemia], [Condition: hyponatremia] and [Condition: hypoglycemia])